Cushing's disease is associated with a tumor in what part of the body?

Most cases of Cushing's syndrome are due to increased adrenocorticotropic hormone production from a pituitary adenoma,